La discriminación espacial de estímulos táctiles:
1. Aumenta con el tamaño de los campos receptores.
2. Aumenta si la convergencia de las vías aferentes es grande.
3. Aumenta si hay inhibición lateral
4. Es independiente de la densidad de inervación.
5. Depende sólo del tipo de receptor activado.

Respuesta correcta: 3. Aumenta si hay inhibición lateral